Clinical trial exclusion criterion:
History of allergy, hypersensitivity, or intolerance to HORIZANT or any other gabapentin products (eg, Neurontin®, Gralise®).

Annotated entities:
- Condition: "allergy"
- Condition: "hypersensitivity"
- Condition: "intolerance"
- Drug: "HORIZANT"
- Drug: "gabapentin"
- Drug: "Neurontin"
- Drug: "Gralise"